下列關於人類免疫缺乏病毒（HIV）實驗室診斷之敘述，何者正確？
A. 主要是血清學診斷，即偵測血中是否有 HIV 病毒之抗原
B. 其中西方墨點法屬血清學診斷之一，主要用於初步篩選
C. 其中酵素連結免疫吸附法（ELISA）屬血清學診斷之一，主要用於確認檢驗
D. 用反轉錄聚合酶鏈反應法（RT-PCR）可偵測血中 HIV 病毒 RNA 的存在

正確答案：D. 用反轉錄聚合酶鏈反應法（RT-PCR）可偵測血中 HIV 病毒 RNA 的存在